Clinical trial inclusion criterion:
1. Patients with stable (Canadian Cardiovascular Society 1, 2, 3 or 4) or unstable (Braunwald class IB, IC, IIB, IIC, IIIB, IIIC) angina pectoris and ischemia, or patients with atypical chest pain or even those who are asymptomatic provided they have documented myocardial ischaemia (e.g. treadmill exercise test, radionuclide scintigraphy, stress echocardiography, Holter tape);

Entity relations:
- Has_value("Canadian Cardiovascular Society", "1, 2, 3 or 4")
- Subsumes("stable", "Canadian Cardiovascular Society")
- Subsumes("unstable", "Braunwald class")
- Has_qualifier("angina pectoris", "stable")
- AND("documented", "myocardial ischaemia")
- Has_context("asymptomatic", "documented")
- Subsumes("documented", "treadmill exercise test")
- Has_value("Braunwald class", "IB")
- OR("stable", "unstable")
- OR("angina pectoris", "atypical chest pain")
- OR("treadmill exercise test", "Holter tape", "radionuclide scintigraphy", "stress echocardiography")
- OR("IB", "IIIB", "IIC", "IIB", "IC", "IIIC")
- OR("ischemia", "atypical chest pain")